下列對於腸病毒（enteroviruses）的描述，何者錯誤？
A. 在 pH3 至 pH9 之環境下仍具抗性
B. 病毒基因體（naked genome）本身具感染之能力
C. 病毒 RNA 在細胞中會被轉譯成 polyprotein
D. 病毒在細胞核複製其子代

正確答案：D. 病毒在細胞核複製其子代